Clinical trial exclusion criterion:
Body mass index (BMI) < 18.5 kg/m2 or > 25 kg/m2.

Annotated entities:
- Measurement: "Body mass index"
- Measurement: "BMI"
- Value: "< 18.5 kg/m2"
- Value: "> 25 kg/m2"